Clinical trial exclusion criterion:
Patients who have taken antidepressants or anti-epileptic drugs, sedative hypnotics, selective serotonin reuptake inhibitor, short-acting analgesics, topical medications and anesthetics and/or muscle relaxants when taking Tramadol/Acetaminophen

Annotated entities:
- Drug: "antidepressants"
- Drug: "anti-epileptic drugs"
- Drug: "sedative hypnotics"
- Drug: "selective serotonin reuptake inhibitor"
- Drug: "short-acting analgesics"
- Drug: "topical medications"
- Drug: "anesthetics"
- Drug: "muscle relaxants"
- Drug: "Tramadol"
- Drug: "Acetaminophen"
- Temporal: "when taking Tramadol/Acetaminophen"
- Reference_point: "taking Tramadol/Acetaminophen"